The virus that causes FIP, Feline Infectious Peritonitis belongs to what family?

Feline infectious peritonitis (FIP) is a common and highly lethal coronavirus disease of domestic cats.